MCI (MoCA >18<26 -inclusive of 1 point if <12 years of education Group 2

The above is a clinical trial inclusion criterion. Annotated with entity spans:
[Condition: MCI] ([Measurement: MoCA] [Value: >18<26] [Non-representable: -inclusive of 1 point if <12 years of education Group 2]